Clinical trial exclusion criterion:
Polycystic ovary syndrome (PCOS) as defined by the Rotterdam criteria.

Entity relations:
- Has_qualifier("Polycystic ovary syndrome (PCOS)", "Rotterdam criteria")